Patients deprived of their civic rights, in custody, or subject to a tutorial, judiciary or administrative decision.

The above is a clinical trial exclusion criterion. Annotated with entity spans:
Patients [Condition: deprived of their civic rights], [Condition: in custody], or [Condition: subject to a tutorial], judiciary or administrative decision.